Clinical trial exclusion criterion:
Co-morbidities that require corticosteroid therapy (e.g. asthma, inflammatory bowel disease).

Annotated entities:
- Drug: "corticosteroid therapy"
- Condition: "asthma"
- Condition: "inflammatory bowel disease"
- Condition: "Co-morbidities"